Clinical trial inclusion criterion:
Willing to attempt to abstain from alcohol completely for the duration of the study

Annotated entities:
- Mood: "Willing"
- Condition: "abstain from alcohol"
- Qualifier: "completely"